Clinical trial exclusion criterion:
Current medication use which interact with either aspirin or atorvastatin

Annotated entities:
- Temporal: "Current"
- Drug: "medication"
- Drug: "aspirin"
- Drug: "atorvastatin"
- Condition: "interact"